Clinical trial exclusion criterion:
Previous bypass surgery or stenting of the superficial femoral artery

Annotated entities:
- Procedure: "bypass surgery"
- Temporal: "Previous"
- Device: "stenting of the superficial femoral artery"